關於腦下垂體泌乳激素腺瘤（pituitary prolactin adenoma）在懷孕期間的追蹤之敘述，下列何者錯誤？
A. 腺瘤在懷孕期間，可以檢查血中泌乳激素值來追蹤
B. 可利用視野檢查來評估
C. 可利用MRI影像檢查來評估
D. 在懷孕期間若有頭痛與視覺障礙等症狀，須進一步小心評估

正確答案：A. 腺瘤在懷孕期間，可以檢查血中泌乳激素值來追蹤